手術性子宮鏡對於治療下列何種症狀較不適用？
A. 子宮黏膜下肌瘤
B. 多次試管嬰兒失敗
C. 子宮中隔
D. 接近更年期之婦女，正常子宮但經血過多

正確答案：B. 多次試管嬰兒失敗